ASA 2

The above is a clinical trial inclusion criterion. Annotated with entity spans:
[Condition: ASA 2]